What is the most common feature of the Doege–Potter syndrome?

Doege-Potter syndrome is a paraneoplastic syndrome characterized by hypoglycemia secondary to a solitary fibrous tumor of the pleura.